En humanos, la síntesis de ácidos grasos insaturados:
1. Tiene lugar fundamentalmente en la mitocondria.
2. Está catalizada por un sistema enzimático que utiliza un citocromo.
3. Introduce el primer doble enlace en posición ∆12.
4. Introduce dobles enlaces en configuración trans.

Respuesta correcta: 2. Está catalizada por un sistema enzimático que utiliza un citocromo.